頭部腫瘤造成眼睛、鼻子及口腔乾澀，請問此腫瘤最可能發生於何處？
A. 視神經管（optic canal）
B. 翼管（pterygoid canal）
C. 卵圓孔（foramen ovale）
D. 圓孔（foramen rotundum）

正確答案：B. 翼管（pterygoid canal）